Clinical trial inclusion criterion:
To be eligible patients must fulfill the following criteria: Patients on ongoing hypertensive therapy must have a blood pressure ≥ 135/85 mm Hg but lower than 170/105 mm Hg at baseline (Day -1) AND patients must be on stable antihypertensive medications for at least 8 weeks prior to baseline (Day -1).; Newly diagnosed hypertensive patients must have a blood pressure ≥ 135/85 mm Hg but lower than 170/105 mm Hg at baseline (Day -1).

Entity relations:
- AND("hypertensive therapy", "blood pressure")
- Has_value("blood pressure", "≥ 135/85 mm Hg")
- Has_qualifier("antihypertensive medications", "stable")
- Has_temporal("antihypertensive medications", "at least 8 weeks prior to baseline")
- Has_value("blood pressure", "≥ 135/85 mm Hg")
- Has_qualifier("hypertensive patients", "Newly diagnosed")
- AND("hypertensive patients", "blood pressure")
- Has_index("at baseline (Day -1)", "baseline (Day -1)")
- Has_temporal("blood pressure", "at baseline (Day -1)")
- Has_index("at least 8 weeks prior to baseline", "baseline")
- Has_value("blood pressure", "lower than 170/105 mm Hg")
- Has_value("blood pressure", "lower than 170/105 mm Hg")